Clinical trial inclusion criterion:
At least one patent (less than 50 percent stenosed) tibioperoneal runoff vessel.

Annotated entities:
- Multiplier: "At least one"
- Condition: "patent tibioperoneal runoff vessel"